Clinical trial exclusion criterion:
Pregnant or nursing (lactating) women.

Entity relations:
- Subsumes("nursing", "lactating")